衛生署為加強慢性病篩檢，推動「三高計畫」，不包含下列何者？
A. 血壓
B. 血糖
C. 膽固醇
D. 尿酸

正確答案：D. 尿酸